Chronic heart failure NYHA class III or IV

The above is a clinical trial exclusion criterion. Annotated with entity spans:
[Condition: Chronic heart failure] [Measurement: NYHA] [Value: class III or IV]